Clinical trial exclusion criterion:
Patients will not be included if they have reached a stable dose of warfarin, liver dysfunction, alcoholism, use of another anticoagulant, use of chemotherapy, or if they do not meet the inclusion criteria

Entity relations:
- Has_multiplier("warfarin", "stable dose")
- Has_qualifier("anticoagulant", "another")
- OR("warfarin", "liver dysfunction", "anticoagulant", "chemotherapy", "alcoholism")